一位 55 歲女性雖呈現甲狀腺不規則腫大，但甲狀腺功能正常。手術後，被切除的甲狀腺經病理檢查發現許多不規則結節含有褐色凝膠狀物質。結節內或其間夾雜出血、纖維化及鈣化或囊狀病灶。下列何者最符合此病人的臨床及病理特徵？
A. follicular adenoma
B. Hashimoto thyroiditis
C. multinodular goiter
D. follicular carcinoma

正確答案：C. multinodular goiter